針對突發性心跳停止病人，使用治療性低溫療法，下列何者是最佳適應症（indication）？
A. 初始心律為心室顫動（ventricular fibrillation），急救後病人神智恢復
B. 初始心律為心搏停止（asystole），急救後病人神智恢復
C. 初始心律為心室顫動（ventricular fibrillation），急救後病人神智昏迷
D. 初始心律為無脈搏電氣活動（pulseless electrical activity），急救後病人神智昏迷

正確答案：C. 初始心律為心室顫動（ventricular fibrillation），急救後病人神智昏迷